Clinical trial inclusion criterion:
FIBRO Spect II index consistent with F3 or F4 AND an AST : platelet ration index (APRI) of > 2 during Screening

Annotated entities:
- Measurement: "FIBRO Spect II index"
- Measurement: "platelet ration index (APRI)"
- Value: "> 2"
- Temporal: "during Screening"
- Value: "F3 or F4"
- Value: "AST"